下列臨床表現，何者不會出現於肺周邊的栓塞症？
A. 咳血
B. 呼吸窘迫
C. 肋膜性胸痛
D. 暈厥

正確答案：D. 暈厥